¿Cuál de los siguientes factores que influyen en la estabilidad de los complejos en disolución es debido a la entropía?:
1. Efecto del campo de ligandos.
2. Número y tamaño de los anillos quelatos.
3. Entalpía de solución de los ligandos.
4. Repulsión estérica entre los ligandos en el complejo.

Respuesta correcta: 2. Número y tamaño de los anillos quelatos.